一位 28 歲女性，最近兩週持續發燒及頭痛。她有先天性心室中隔缺損的病史。腦部電腦斷層顯示右腦頂葉有一個約 3 公分大環狀的（ring-like）顯影病變。下列何種發炎細胞最可能是上述腦病變最主要的組成細胞？
A. 淋巴球（lymphocyte）
B. 嗜中性白血球（neutrophil）
C. 類上皮細胞（epithelioid cell）
D. 漿細胞（plasma cell）

正確答案：B. 嗜中性白血球（neutrophil）